Serious medical or psychiatric illness that would interfere with the ability to adhere to study requirements

The above is a clinical trial exclusion criterion. Annotated with entity spans:
[Qualifier: Serious] [Condition: medical] or [Condition: psychiatric illness] that [Qualifier: would interfere with the ability to adhere to study requirements]